下列孩童各種疾病相關之常見腎結石成分，何者錯誤？
A. 遠端腎小管酸血症（distal renal tubular acidosis）：磷酸鈣（calcium phosphate）結石
B. 潰瘍性大腸炎（ulcerative colitis）：草酸鈣（calcium oxalate）結石
C. 潰瘍性大腸炎：尿酸（uric acid）結石
D. 變形桿菌（Proteus）泌尿道感染：尿酸結石

正確答案：D. 變形桿菌（Proteus）泌尿道感染：尿酸結石